Male and female subjects 18-80 years.

The above is a clinical trial inclusion criterion. Annotated with entity spans:
[Person: Male] and [Person: female] subjects [Value: 18-80] [Person: years].